Los estados de vigilia relajada (ojos cerrados) suelen dar lugar a registros electroencefalográficos con abundancia de:
1. Ondas alfa.
2. Ondas beta.
3. Patrón de arousal.
4. Ondas delta.

Respuesta correcta: 1. Ondas alfa.